Clinical trial exclusion criterion:
All patients who cannot participate in an outpatient physical therapy program for 3 days per week after surgery

Annotated entities:
- Negation: "cannot"
- Procedure: "physical therapy"
- Visit: "outpatient"
- Temporal: "for 3 days per week after surgery"
- Reference_point: "surgery"